Clinical trial exclusion criterion:
HIV positive or active HBV infection or other uncontrolled systematic infection

Entity relations:
- Has_qualifier("systematic infection", "uncontrolled")
- OR("HIV positive", "active HBV infection", "systematic infection")